Clinical trial inclusion criterion:
Having a regular menstrual cycle of which the menstrual period is between day 3-7, and the period between day 25-35;

Annotated entities:
- Condition: "regular menstrual cycle"
- Measurement: "menstrual period"
- Value: "between day 3-7"
- Grammar_Error: "and"
- Value: "between day 25-35"